先生 35 歲，太太 38 歲，懷孕 17 週時在其他醫院接受唐氏症母血篩檢結果如下：唐氏症機率為 1:250， trisomy 18 機率為 1:3500，神經管缺損機率為 1:7800。這對夫妻心理上不願意接受此一結果，因此前來尋求第二位專家之意見。下列處理方式何者最適當？
A. 建議施行臍帶血採樣以檢驗胎兒染色體
B. 建議施行羊膜腔穿刺檢查以檢驗胎兒染色體
C. 建議施行高層次胎兒超音波檢查以偵測唐氏症之細微特徵，例如 echogenic bowel, posterior nuchal
D. 重複唐氏症母血篩檢

正確答案：B. 建議施行羊膜腔穿刺檢查以檢驗胎兒染色體